Serum creatinine > twice the upper limit of the normal range

The above is a clinical trial exclusion criterion. Annotated with entity spans:
[Measurement: Serum creatinine] [Value: > twice the upper limit of the normal range]